Clinical trial inclusion criterion:
E.coli in blood culture

Entity relations:
- Has_value("blood culture", "E.coli")